Clinical trial exclusion criterion:
Syncope related to cardiac disease

Entity relations:
- AND("Syncope", "cardiac disease")